Clinical trial exclusion criterion:
Patients with documented gastrointestinal, cerebral, or other hemorrhage within 3 months of the operation;

Entity relations:
- Has_index("within 3 months of the operation", "operation")
- Has_temporal("gastrointestinal hemorrhage", "within 3 months of the operation")
- OR("gastrointestinal hemorrhage", "cerebral hemorrhage", "hemorrhage")